Subjects with taking any medication affecting level of LDL (Fenofibrate, Omega 3 fatty aicd etc.)

The above is a clinical trial exclusion criterion. Annotated with entity spans:
Subjects with taking any [Drug: medication] [Condition: affecting] level of [Procedure: LDL] ([Drug: Fenofibrate], [Drug: Omega 3 fatty aicd] etc.)